Clinical trial exclusion criterion:
Women of child-bearing potential

Entity relations:
- AND("child-bearing potential", "Women")